一人獨居臺灣的趙女士因大便習慣改變接受大腸鏡檢查，被發現在乙狀結腸有環形生長的腫瘤，且即將完全阻塞腸道。在醫師告知她必須接受手術時她斷然拒絕，並告知醫師她的先生和獨生子先後因傷病接受手術引發併發症而死亡。接下來，醫師最合宜的處理方式為何？
A. 直接聽從趙女士的決定不予安排手術
B. 以矇騙的方式為趙女士安排手術
C. 暫時擱置決策待情況變化再決定
D. 致力於與趙女士作更充分的溝通

正確答案：D. 致力於與趙女士作更充分的溝通